RMI contre-indication(particle or metal prosthesis, pacemaker, claustrophobia) or contrast product contre-indication (allergy)

The above is a clinical trial exclusion criterion. Annotated with entity spans:
[Condition: RMI contre-indication](particle or metal prosthesis, pacemaker, claustrophobia) or contrast product contre-indication (allergy)